Clinical trial exclusion criterion:
Need for dual organ transplant

Entity relations:
- Has_mood("dual organ transplant", "Need for")